Clinical trial exclusion criteria:
Evidence of concomitant infection on exam or gram stain (i.e. herpes, both bacteria and acanthamoeba on gram stain)
Impending or frank perforation at recruitment
Involvement of sclera at presentation
Non-infectious or autoimmune keratitis
History of corneal transplantation or recent intraocular surgery
No light perception in the affected eye
Pinhole visual acuity worse than 20/200 in the unaffected eye
Participants who are decisionally and/or cognitively impaired

Annotated entities:
- Condition: "concomitant infection"
- Condition: "perforation"
- Condition: "Involvement of sclera"
- Condition: "autoimmune keratitis"
- Condition: "Non-infectious keratitis"
- Procedure: "corneal transplantation"
- Procedure: "intraocular surgery"
- Negation: "No"
- Condition: "light perception"
- Measurement: "Pinhole visual acuity"
- Value: "worse than 20/200"
- Condition: "cognitively impaired"